磺氨類（sulfonamides）藥物屬於抗代謝類藥物，會和細菌體內何種化合物競爭，而阻止該菌生長代謝所必須之葉酸合成？
A. p-胺基苯甲酸（p-aminobenzoic acid）
B. 甲硫氨酸（methionine）
C. 四葉酸（tetrafolate）
D. 二氫葉酸還原酶（dihydrofolate reductase）

正確答案：A. p-胺基苯甲酸（p-aminobenzoic acid）